下列分子缺陷中，何者最常與偶發性（sporadic）副甲狀腺腺瘤有關？
A. cyclin D1
B. calcium-sensing receptor
C. vitamin D receptor
D. parathyroid hormone

正確答案：A. cyclin D1